Clinical trial inclusion criterion:
HbA1c = 5.7%

Entity relations:
- Has_value("HbA1c", "= 5.7%")